Clinical trial exclusion criterion:
ketoacidosis with a Base Excess >=2

Entity relations:
- AND("ketoacidosis", "Base Excess")
- Has_value("Base Excess", ">=2")